What is the route of administration of eptinezumab?

Eptinezumab is administered intravenously.